What is the mechanism of action of Evinacumab?

Evinacumab is a monoclonal antibody against angiopoietin-like protein 3 (ANGPTL3) that has been shown to reduce low-density lipoprotein cholesterol in patients with homozygous familial hypercholesterolemia.